Las ARNt-aminoacil-transferasas:
1. Unen el aminoácido al ribosoma.
2. Unen el aminoácido al anticodón del ARNt.
3. Son RNA polimerasas.
4. Garantizan la fidelidad de la traducción.
5. No son importantes en la traducción.

Respuesta correcta: 4. Garantizan la fidelidad de la traducción.